Clinical trial inclusion criterion:
4. Right-handed.

Annotated entities:
- Parsing_Error: "4."
- Condition: "Right-handed"